Clinical trial exclusion criterion:
Previous catheter radiofrequency ablation for AF or cardiac surgery;

Entity relations:
- AND("catheter radiofrequency ablation", "AF")
- OR("catheter radiofrequency ablation", "cardiac surgery")